Coagulopathy

The above is a clinical trial exclusion criterion. Annotated with entity spans:
[Condition: Coagulopathy]